Clinical trial exclusion criterion:
A history or currently hematologic and other cancers;

Annotated entities:
- Non-representable: "A history or currently hematologic and other cancers;"